Se quiere realizar un estudio para valorar el efecto de la exposición al consumo de alcohol sobre el cáncer de páncreas. Es posible que la relación pueda estar afectada por el efecto de la exposición al consumo de tabaco. Si sólo se quiere analizar el efecto del consumo de alcohol, ¿qué tipo de sesgo se puede producir?
1. Sesgo de exposición.
2. Sesgo de diagnóstico.
3. Sesgo de realización.
4. Sesgo por efecto vigilancia (o de Hawthorne).
5. Sesgo de confusión.

Respuesta correcta: 5. Sesgo de confusión.